Where, in the body, would the Cobb-Stainsby excision arthroplasty be performed?

The Cobb-Stainsby forefoot arthroplasty combines partial phalangectomy ( Stainsby ) with extensor tendon transfer to the metatarsal head ( Cobb ) .